Clinical trial inclusion criterion:
Are psychologically stable and suitable for interventions determined by the investigator

Annotated entities:
- Condition: "psychologically stable"
- Condition: "suitable for interventions"
- Qualifier: "determined by the investigator"